Clinical trial inclusion criterion:
HbA1c 8.0 - 10.5 %

Entity relations:
- Has_value("HbA1c", "8.0 - 10.5 %")